Age< 18

The above is a clinical trial exclusion criterion. Annotated with entity spans:
[Person: Age][Value: < 18]